En la secuenciación de ADN por el método de Sanger:
1. Los 2`-3` didesoxinucleótidos son esenciales.
2. Hay que usar inhibidores suicidas de la ADN polimerasa.
3. El ADN debe mantener su estructura de doble hélice.
4. El ADN es hidrolizado selectivamente.
5. Son fundamentales las endonucleasas de restricción.

Respuesta correcta: 1. Los 2`-3` didesoxinucleótidos son esenciales.